Un paciente acude a urgencias por presentar una eritrodermia con fiebre y malestar general. En la exploración se aprecia en las uñas la presencia de piqueteado ungueal y unas zonas amarillentas distales en mancha de aceite. ¿Cuál es la enfermedad primaria que ha originado el cuadro?
1. Linfoma cutáneo.
2. Dermatitis atópica.
3. Psoriasis.
4. Ictiosis.

Respuesta correcta: 3. Psoriasis.